Laparoscopic cholecystectomy

The above is a clinical trial inclusion criterion. Annotated with entity spans:
[Qualifier: Laparoscopic] [Procedure: cholecystectomy]